Elective TNTS resection of Pituitary Tumor

The above is a clinical trial inclusion criterion. Annotated with entity spans:
[Qualifier: Elective] [Procedure: TNTS resection] of [Condition: Pituitary Tumor]